Clinical trial exclusion criterion:
unilateral ovariectomy

Entity relations:
- Has_qualifier("ovariectomy", "unilateral")